Clinical trial exclusion criterion:
Ovarian cancer, adrenal gland tumor, endometrial cancer, cervical cancer, breast cancer

Annotated entities:
- Condition: "Ovarian cancer"
- Condition: "adrenal gland tumor"
- Condition: "endometrial cancer"
- Condition: "cervical cancer"
- Condition: "breast cancer"